Clinical trial exclusion criterion:
Subject has history of previous myocardial infarction or percutaneous intervention during the last three months.

Annotated entities:
- Condition: "myocardial infarction"
- Procedure: "percutaneous intervention"
- Temporal: "last three months"